一位 64 歲男性，胃鏡檢查發現胃竇部有一個 5 公分大的黏膜下腫瘤，腫瘤上方黏膜中央處有潰瘍的現象。切除腫瘤，在顯微鏡下可見腫瘤由梭狀細胞所構成，免疫組織化學染色可見幾乎所有腫瘤細胞有明顯 c-KIT 的表現。下列何者是最可能的診斷？
A. 胃腸間質瘤（gastrointestinal stromal tumor）
B. 平滑肌瘤（leiomyoma）
C. 黏膜相關淋巴組織淋巴瘤（mucosa-associated lymphoid tissue lymphoma; MALToma）
D. 戒環細胞癌（Signet-ring cell carcinoma）

正確答案：A. 胃腸間質瘤（gastrointestinal stromal tumor）